Clinical trial exclusion criterion:
Subjects considered by the Investigator to be unsuitable for the study.

Annotated entities:
- Non-query-able: "Subjects considered by the Investigator to be unsuitable for the study"